Clinical trial exclusion criterion:
Children with any basal condition (trauma, infection, minor accidents, etc..) will be able to participate in the study provided they and their family are willing and do not meet the above-mentioned exclusion criteria.

Annotated entities:
- Condition: "basal condition"
- Condition: "trauma"
- Condition: "infection"
- Condition: "minor accidents"